Which agents are included in the FLAMSA chemotherapy regimen?

Fludarabine, cytarabine and amsacrine are included in the FLAMSA chemotherapy regimen.